Pregnant, nursing, or not using effective methods of birth control

The above is a clinical trial exclusion criterion. Annotated with entity spans:
[Condition: Pregnant], [Condition: nursing], or [Negation: not] using [Qualifier: effective methods] of [Procedure: birth control]